一位 40 歲男性病人，因膽結石併膽囊炎接受腹腔鏡膽囊切除手術。病人曾於術前因右肘肌腱炎而服用阿斯匹靈。病人於術後四小時主訴右上腹及右肩相當疼痛，其心跳數為 118 /min，血壓為 75/50 mmHg，此時病人的問題為：
A. 因腹內氣體未排除完全之故
B. 因腹內感染引起敗血症休克
C. 因傷口疼痛引起的反應
D. 因術後腹腔內持續出血之故

正確答案：D. 因術後腹腔內持續出血之故